Pregnancy, age < 18, nursing, or documented allergy to naloxone

The above is a clinical trial exclusion criterion. Annotated with entity spans:
[Condition: Pregnancy], [Person: age] [Value: < 18], [Condition: nursing], or documented [Condition: allergy] to [Drug: naloxone]